Clinical trial exclusion criterion:
significant valvular disease,

Annotated entities:
- Condition: "valvular disease"
- Qualifier: "significant"